Clinical trial inclusion criterion:
Non-affective psychosis

Annotated entities:
- Condition: "Non-affective psychosis"